Patients with known or suspected heparin induced thrombocytopenia prior to consent

The above is a clinical trial exclusion criterion. Annotated with entity spans:
Patients with [Mood: known] or [Mood: suspected] [Qualifier: heparin induced] [Condition: thrombocytopenia] [Temporal: prior to consent]